American Society of Anesthesiology (ASA) Class I and II

The above is a clinical trial inclusion criterion. Annotated with entity spans:
[Measurement: American Society of Anesthesiology (ASA) Class] [Value: I and II]